¿Cuál de las siguientes reacciones del metabolismo de fármacos tiene una reacción de oxidación como paso intermedio?:
1. La transformación de un grupo nitro (por ejemplo, el existente en la nitrofurantoína) en amino.
2. La O-desmetilación de un éter (por ejemplo, la transformación de la codeína en morfina).
3. La ruptura de un grupo diazo para originar una amina (por ejemplo, la transformación del Prontosilrubrum en sulfanilamida.
4. La transformación del oxazepam en su glucurónido.
5. La transformación de la acetilcolina en colina.

Respuesta correcta: 2. La O-desmetilación de un éter (por ejemplo, la transformación de la codeína en morfina).